Clinical trial exclusion criterion:
Known or suspected hypersensitivity to either propofol, e.g. egg or soy allergy, or volatile general anesthetic agents

Entity relations:
- AND("allergy", "egg")
- AND("hypersensitivity", "propofol")
- Has_mood("hypersensitivity", "Known")
- OR("egg", "soy")
- OR("propofol", "volatile general anesthetic agents")
- OR("hypersensitivity", "allergy")
- OR("Known", "suspected")